Which protein does empagliflozin inhibit?

Empagliflozin (Jardiance)  is a SGLT2 inhibitor.